Patients without prostatectomy: 2 consecutive rises in PSA levels relative to a previous reference value, separated by one month. The first measurement must occur one month after the reference value and must be above the reference value. The second confirmatory measurement taken one month after the first measurement must be greater than the first measurement.

The above is a clinical trial inclusion criterion. Annotated with entity spans:
Patients [Negation: without] [Procedure: prostatectomy]: [Value: 2] [Temporal: consecutive] [Value: rises] in [Measurement: PSA levels] relative to a previous reference value, [Temporal: separated by one month]. The [Value: first] [Procedure: measurement] must occur [Temporal: one month after the reference value] and must be [Value: above the reference value]. The [Value: second] confirmatory [Procedure: measurement] taken [Temporal: one month after the first measurement] must be [Value: greater than the first measurement].